Clinical trial inclusion criteria:
Pathologically proven unresectable adenocarcinoma of stomach
With uni-dimensionally measurable disease (at least longest diameter 2 cm on conventional CT scan, x-ray or physical examination, or 1cm on spiral CT scan)
Age 18 to 70 years old
Estimated life expectancy of more than 3 months
ECOG performance status of 2 or lower
Adequate bone marrow function(absolute neutrophil count [ANC] ≥1,500/µL, hemoglobin ≥9.0 g/dL,and platelets ≥100,000/µL)
Adequate kidney function (serum creatinine < 1.5 mg/dL)
Adequate liver function (serum total bilirubin < 2 times the upper normal limit (UNL); serum transaminases levels <3 times [<5 times for patients with liver metastasis] UNL)
No prior chemotherapy but prior adjuvant chemotherapy finished at least 6 months before enrollment was allowed. (but, prior adjuvant chemotherapy with capecitabine or S-1 or camptothecin analogues was excluded)
No prior radiation therapy for at least 4 weeks before enrollment in the study

Annotated entities:
- Condition: "adenocarcinoma of stomach"
- Qualifier: "unresectable"
- Measurement: "Pathologically"
- Value: "proven"
- Condition: "disease"
- Qualifier: "uni-dimensionally measurable"
- Measurement: "longest diameter"
- Procedure: "conventional CT scan"
- Value: "at least 2 cm"
- Procedure: "x-ray"
- Procedure: "physical examination"
- Procedure: "spiral CT scan"
- Measurement: "longest diameter"
- Value: "at least 1cm"
- Person: "Age"
- Value: "18 to 70 years old"
- Measurement: "Estimated life expectancy"
- Value: "more than 3 months"
- Measurement: "ECOG performance status"
- Value: "2 or lower"
- Measurement: "bone marrow function"
- Value: "Adequate"
- Measurement: "absolute neutrophil count [ANC]"
- Value: "≥1,500/µL"
- Measurement: "hemoglobin"
- Value: "≥9.0 g/dL"
- Measurement: "platelets"
- Value: "≥100,000/µL"
- Measurement: "kidney function"
- Value: "Adequate"
- Measurement: "serum creatinine"
- Value: "< 1.5 mg/dL"
- Measurement: "liver function"
- Value: "Adequate"
- Measurement: "serum total bilirubin"
- Value: "< 2 times the upper normal limit (UNL)"
- Measurement: "serum transaminases levels"
- Value: "<3 times UNL"
- Condition: "liver metastasis"
- Value: "<5 times UNL"
- Procedure: "chemotherapy"
- Temporal: "prior"
- Negation: "No"
- Procedure: "adjuvant chemotherapy"
- Temporal: "prior"
- Temporal: "at least 6 months before enrollment"
- Procedure: "adjuvant chemotherapy"
- Temporal: "prior"
- Drug: "capecitabine"
- Drug: "S-1"
- Drug: "camptothecin analogues"
- Negation: "excluded"
- Reference_point: "enrollment"
- Negation: "was allowed"
- Procedure: "radiation therapy"
- Temporal: "at least 4 weeks before enrollment"
- Negation: "No"
- Temporal: "prior"
- Reference_point: "enrollment"